Clinical trial exclusion criterion:
Hyper- or hypothyroidism (subjects requiring medication to maintain TSH levels in the normal range are eligible if all other inclusion/exclusion criteria are met)

Entity relations:
- OR("Hyper thyroidism", "hypothyroidism")